¿Cuál de los siguientes métodos de reducción de tamaño de partícula en una mezcla pulverulenta consigue menores intervalos de tamaños?:
1. Métodos de corte.
2. Métodos de compresión.
3. Métodos de impacto.
4. Métodos de fricción.

Respuesta correcta: 4. Métodos de fricción.